bone-specific pretreatment (DMAB, TPTD, strontium ranelate, SERMs) Bisphosphonate treatment is allowed

The above is a clinical trial exclusion criterion. Annotated with entity spans:
[Procedure: bone-specific pretreatment] ([Drug: DMAB], [Drug: TPTD], [Drug: strontium ranelate], [Drug: SERMs]) [Non-representable: Bisphosphonate treatment is allowed]